Clinical trial inclusion criterion:
Cohort 1: Recurrent or refractory medulloblastoma in which current standard treatment approaches have failed; biopsy is not required for recurrent disease.

Entity relations:
- Has_qualifier("standard treatment", "failed")
- AND("refractory medulloblastoma", "standard treatment")
- AND("Recurrent medulloblastoma", "standard treatment")